Clinical trial exclusion criterion:
Subject with a known hypersensitivity to any component of the investigational medications, monoamine oxidase inhibitors, phosphodiesterase type 5 inhibitors or phenylethylamines

Annotated entities:
- Condition: "hypersensitivity"
- Qualifier: "investigational"
- Drug: "medications"
- Drug: "monoamine oxidase inhibitors"
- Drug: "phosphodiesterase type 5 inhibitors"
- Drug: "phenylethylamines"